Clinical trial inclusion criterion:
Patients must have adequate organ and marrow function

Annotated entities:
- Measurement: "organ function"
- Measurement: "marrow function"
- Value: "adequate"
- Subjective_judgement: "adequate"
- Undefined_semantics: "adequate"